Living, singleton fetus

The above is a clinical trial inclusion criterion. Annotated with entity spans:
[Qualifier: Living], [Condition: singleton fetus]